Clinical trial inclusion criterion:
Stable (8 wks or longer) concurrent medications including benzodiazepines, sedative hypnotics, antipsychotics, and antidepressants.

Entity relations:
- Has_qualifier("medications", "concurrent")
- Has_qualifier("medications", "Stable")
- Has_temporal("medications", "8 wks or longer")
- Subsumes("medications", "benzodiazepines")
- OR("benzodiazepines", "antipsychotics", "sedative hypnotics", "antidepressants")